4. Inability or unwillingness of a participant and/or guardian to provide informed consent

The above is a clinical trial exclusion criterion. Annotated with entity spans:
4. [Non-query-able: Inability or unwillingness of a participant and/or guardian to provide informed consent]